ECOG Score of 0 or 1.

The above is a clinical trial inclusion criterion. Annotated with entity spans:
[Measurement: ECOG Score] of [Value: 0 or 1].